4. Has WHO/NYHA-FC of II or III.

The above is a clinical trial inclusion criterion. Annotated with entity spans:
[Parsing_Error: 4.] Has [Measurement: WHO/NYHA-FC] of [Value: II] or [Value: III].